有關睡眠呼吸中止症（sleep apnea）的敘述，下列何者錯誤？
A. 正常成人在睡眠中如呼吸氣流停止超過 10 秒以上，稱為顯著的呼吸中止
B. 嚴重型之定義為 apnea-hypopnea index（AHI）大於 30 次／小時
C. 依發生機轉可分成三型，以混合型居多
D. 中樞性呼吸中止症病人，口鼻氣流停止時，同時也無胸部或其他呼吸運動

正確答案：C. 依發生機轉可分成三型，以混合型居多